La regla de Markovnikov predice la regioselectividad en las reacciones de:
1. Sustitución nucleofila.
2. Sustitución electrófila aromática.
3. Adición electrófila.
4. Adición nucleofila.
5. Oxidación de alcoholes.

Respuesta correcta: 3. Adición electrófila.